下列有關表皮（epidermis）的敘述，何者正確？
A. 幹細胞（stem cell）主要分布在棘層（stratum spinosum）
B. 皮脂腺（sebaceous gland）的腺體部主要位於表皮之基底層（stratum basale）
C. 默氏細胞（Merkel's cell）主要位於顆粒層（stratum granulosum）
D. 在手掌或腳掌之厚皮膚會出現明顯的透明層（stratum lucidum）

正確答案：D. 在手掌或腳掌之厚皮膚會出現明顯的透明層（stratum lucidum）